American Society of Anesthesiologist physical status 1-3

The above is a clinical trial inclusion criterion. Annotated with entity spans:
[Measurement: American Society of Anesthesiologist physical status] [Value: 1-3]